復健評估中，下列那一項不是屬於ADL（activities of daily living）及IADL（Instrumental  ADL）的評估內容？
A. 握力大小
B. 輪椅移位
C. 烹煮食物
D. 穿戴護腰

正確答案：A. 握力大小